Clinical trial exclusion criterion:
current substance use disorder

Annotated entities:
- Temporal: "current"
- Condition: "substance use disorder"